Clinical trial inclusion criteria:
Post menopausal women with a history of estrogen positive breast cancer who are receiving aromatase inhibitors for at least one month.
Patients must complain of mild to moderate arthralgia.
Ability to understand and sign informed consent.
Patients meet criteria for low to moderate risk for moderate exercise based oon the ACSM guidelines.

Annotated entities:
- Condition: "Post menopausal"
- Person: "women"
- Temporal: "history"
- Qualifier: "estrogen positive"
- Condition: "breast cancer"
- Drug: "aromatase inhibitors"
- Temporal: "for at least one month"
- Condition: "arthralgia"
- Qualifier: "moderate"
- Qualifier: "mild"
- Post-eligibility: "Ability to understand and sign informed consent."
- Value: "low"
- Value: "moderate"
- Measurement: "risk for moderate exercise"
- Measurement: "ACSM guidelines"